4. Morphologically documented primary AML or AML secondary to myelodysplastic syndrome (MDS with ≥20% bone marrow or peripheral blasts), as defined by the World Health Organization (WHO) criteria, confirmed by pathology review at treating institution.

The above is a clinical trial inclusion criterion. Annotated with entity spans:
4. [Qualifier: Morphologically documented] [Qualifier: primary] [Condition: AML] or [Condition: AML] secondary to [Condition: myelodysplastic syndrome] ([Condition: MDS] with [Value: ≥20%] [Measurement: bone marrow] or [Measurement: peripheral blasts]), as defined by the [Procedure: World Health Organization (WHO) criteria], confirmed by [Procedure: pathology review] at treating institution.